Clinical trial exclusion criterion:
Gastroparesis

Annotated entities:
- Condition: "Gastroparesis"